Clinical trial exclusion criterion:
End stage chronic renal disease: Subjects will be excluded if on renal replacement therapy (hemodialysis or peritoneal).

Entity relations:
- AND("renal replacement therapy", "hemodialysis")
- Subsumes("End stage chronic renal disease", "renal replacement therapy")
- OR("hemodialysis", "peritoneal")